Clinical trial exclusion criterion:
No complications due to other interventions

Entity relations:
- Has_qualifier("interventions", "other")
- AND("complications", "interventions")
- Has_negation("complications", "No")